Diagnosed with TB by criteria per Brazilian Ministry of Health

The above is a clinical trial inclusion criterion. Annotated with entity spans:
Diagnosed with [Condition: TB] by [Qualifier: criteria per Brazilian Ministry of Health]